Clinical trial inclusion criterion:
Greater than 4 months out from C-spine injury

Entity relations:
- Has_temporal("C-spine injury", "Greater than 4 month")